Clinical trial inclusion criterion:
5. Presence of evaluable (measureable or non-measurable) disease.

Annotated entities:
- Non-representable: "Presence of evaluable (measureable or non-measurable) disease."